氣性壞疽（gas gangrene）是下列何者所造成的壞死？
A. 黴菌感染
B. 肺氣腫（pulmonary emphysema）
C. 梭狀芽孢桿菌（Clostridium）感染
D. 氣體栓塞（gas embolism）

正確答案：C. 梭狀芽孢桿菌（Clostridium）感染